Clinical trial inclusion criterion:
Severe chronic kidney disease (Stage 4 and 5)

Entity relations:
- Has_qualifier("chronic kidney disease", "Severe")
- Subsumes("chronic kidney disease", "Stage 4 chronic kidney disease")
- Subsumes("chronic kidney disease", "Stage 5 chronic kidney disease")
- OR("Stage 5 chronic kidney disease", "Stage 4 chronic kidney disease")